Clinical trial inclusion criterion:
Teeth with signs and symptoms of reversible pulpitis

Entity relations:
- Has_qualifier("reversible pulpitis", "Teeth")